La estructura de la cápside de los paramixovirus presenta simetría:
1. Compleja.
2. Icosaédrica.
3. Esférica.
4. Helicoidal.

Respuesta correcta: 4. Helicoidal.